HBsAg negative, HBcAb negative, HBsAb positive patients are eligible.

The above is a clinical trial inclusion criterion. Annotated with entity spans:
[Measurement: HBsAg] [Value: negative], [Measurement: HBcAb] [Value: negative], [Measurement: HBsAb] [Value: positive] patients are eligible.